Clinical trial inclusion criterion:
Atrial fibrillation or flutter on electrocardiogram

Entity relations:
- AND("electrocardiogram", "Atrial fibrillation")
- OR("Atrial fibrillation", "Atrial flutter")